下列關於消化道內視鏡處置之敘述，何者正確？
A. 如果病人解大量鮮血便（hematochezia），必為下消化道的大量出血，要緊急安排大腸鏡
B. 施行內視鏡前，假如有服用低劑量阿斯匹靈則必須先停藥一週
C. 所有黃疸病患都是施行逆行性膽胰鏡（endoscopic retrograde cholangiopancreatography, ERCP）的適應症
D. 消化道早期表淺癌，逐漸有以內視鏡切除（endoscopic or endoluminal resection）之趨勢

正確答案：D. 消化道早期表淺癌，逐漸有以內視鏡切除（endoscopic or endoluminal resection）之趨勢